Adult kidney transplant recipients > 18 y.o.

The above is a clinical trial inclusion criterion. Annotated with entity spans:
[Person: Adult] [Procedure: kidney transplant] recipients [Value: > 18] [Person: y.o.]